一位 62 歲女性病人，罹患糖尿病十年，最近一個月以 angiotensin-converting enzyme inhibitor 控制高血壓於 130/80 mmHg，兩週前血液肌酸酐 1.0 mg/dL，最近 2 週血壓升至 170/100 mmHg，少尿、水腫、端坐呼吸、食慾不振、嘔吐。現在的血液 BUN 60 mg/dL，肌酸酐 3.5 mg/dL，尿液蛋白質 4+。 下列敘述何者最正確？
A. 立即停用 angiotensin-converting enzyme inhibitor
B. 立即做腎臟切片檢查
C. 立即做 renal arteriography 檢查
D. 立即以脈衝式類固醇（pulse methylprednisolone）治療

正確答案：A. 立即停用 angiotensin-converting enzyme inhibitor